小於 45 歲之女性最好發之肺癌為下列何者？
A. 小細胞肺癌
B. 鱗狀上皮細胞癌
C. 腺癌
D. 大細胞肺癌

正確答案：C. 腺癌